Clinical trial inclusion criterion:
ability to read and understand English

Entity relations:
- OR("ability to understand English", "ability to read English")